NA

The above is a clinical trial exclusion criterion. Annotated with entity spans:
[Parsing_Error: NA]